小美目前懷孕 22 週，因為有子宮早期收縮情形，醫師幫她做胎兒纖維黏連蛋白的檢驗，下列有關胎兒纖維黏連蛋白（fetal fibronectin）之敘述，何者錯誤？
A. 可偵測早產
B. 可知胎兒肺部成熟度（lung maturity）
C. 正常懷孕中期不應出現在陰道
D. 為一種 extracellular matrix

正確答案：B. 可知胎兒肺部成熟度（lung maturity）